胰管及總膽管相接之處的異常構造（Anomalous junction of pancreatic duct and common bile duct）可能會引起甚麼疾病？
A. 膽道閉鎖
B. 膽管囊腫
C. 胰管囊腫
D. 十二指腸囊腫

正確答案：B. 膽管囊腫